下列那一種利尿劑合併生理食鹽水注射投與，用於治療血鈣過高之症狀效果最好？
A. furosemide
B. hydrochlorothiazide
C. amiloride
D. conivaptan

正確答案：A. furosemide